下列有關氣喘的發病機制（pathogenesis），何者正確？
A. 呼吸道上皮細胞主要為防禦功能，並不參與發炎反應
B. 過敏原或病毒性感染會誘使T helper 2（TH2）淋巴球分泌interleukin-5，促使嗜酸性白血球進入呼吸道
C. 氣喘的發炎介質會導致呼吸道平滑肌收縮，但平滑肌本身並不會釋放發炎介質
D. 嗜中性白血球主要是對抗細菌性感染，並不參與發炎反應

正確答案：B. 過敏原或病毒性感染會誘使T helper 2（TH2）淋巴球分泌interleukin-5，促使嗜酸性白血球進入呼吸道